50歲男性，發生左心室梗塞，二週後出現肺充血及肋膜腔積水，在肺部出現大量褐色的心衰竭細胞（heart failure cells），下列何者是此種褐色細胞的來源？
A. 心肌細胞
B. 心內膜細胞
C. 巨噬細胞
D. 纖維芽細胞

正確答案：C. 巨噬細胞